Able to provide informed consent

The above is a clinical trial inclusion criterion. Annotated with entity spans:
[Informed_consent: Able to provide informed consent]